跳蚤（flea）可以傳播下列何種疾病之病原體？
A. 地方性斑疹傷寒（endemic typhus）
B. 流行性斑疹傷寒（epidemic typhus）
C. 恙蟲病（scrub typhus）
D. 落磯山斑疹熱（Rocky Mountain spotted fever）

正確答案：A. 地方性斑疹傷寒（endemic typhus）